Clinical trial inclusion criterion:
Able to complete all testing required by the clinical protocol

Annotated entities:
- Post-eligibility: "Able to complete all testing required by the clinical protocol"